有關B型肝炎病毒的敘述，下列何者錯誤？
A. 帶原者周邊血液中，數量最多的是22 nm大小的病毒顆粒，外觀為球形或⻑絲狀
B. 42 nm大小的病毒顆粒，為雙外殼結構，分別為表面（surface）及核心（core）蛋白，數量僅有22 nm病毒
C. 病毒的核衣殼（nucleocapsid）大小為27 nm，具有表面抗原（HBsAg），病毒DNA和DNA聚合酶
D. B型肝炎病毒的e抗原（HBeAg），包含部分核前（precore）區蛋白及導引至內質網的訊號區

正確答案：C. 病毒的核衣殼（nucleocapsid）大小為27 nm，具有表面抗原（HBsAg），病毒DNA和DNA聚合酶